La telomerasa es una:
1. Topoisomerasa.
2. Transcriptasa inversa.
3. Helicasa.
4. Exonucleasa.

Respuesta correcta: 2. Transcriptasa inversa.